La proteína motora encargada de extender el retículo endoplasmático hacia la periferia celular es:
1. Quinesina.
2. Dineína.
3. Dinactina.
4. Miosina.

Respuesta correcta: 1. Quinesina.